Una deficiencia de carnitina se asocia a:
1. La inhibición de la cadena respiratoria mitocondrial.
2. La inhibición del catabolismo proteico.
3. Un incremento del catabolismo renal de proteínas.
4. Un fallo en la entrada de los ácidos grasos musculares a la mitocondria para su oxidación.
5. Un descenso de la lipogénesis hepática.

Respuesta correcta: 4. Un fallo en la entrada de los ácidos grasos musculares a la mitocondria para su oxidación.